Clinical trial exclusion criterion:
Severe co-morbid illness such as untreatable other malignancy and/or active infections.

Entity relations:
- Has_qualifier("co-morbid illness", "Severe")
- Has_qualifier("infections", "active")
- Has_qualifier("malignancy", "other")
- Has_qualifier("malignancy", "untreatable")
- Subsumes("co-morbid illness", "malignancy")
- OR("malignancy", "infections")